Which epigenetic mark is deposited by PRC2?

H3K27me3 is the endogenous epigenetic mark deposited by PRC2.